下列那一種眼藥可用來鑑別結節狀上鞏膜炎（nodular episcleritis）與結節狀鞏膜炎（nodular scleritis）？
A. 副交感神經抑制劑（如tropicamide）
B. 乙型交感神經抑制劑（如timolol）
C. 副交感神經興奮劑（如pilocarpine）
D. 交感神經興奮劑（如phenylephrine）

正確答案：D. 交感神經興奮劑（如phenylephrine）